有關 Peutz-Jeghers 症候群（Peutz-Jeghers syndrome）之敘述，何者錯誤？
A. 在嘴唇及口腔黏膜出現深褐色斑（macules）
B. 此症候群有消化道瘜肉
C. 乳癌及卵巢癌發生率不會增加
D. 深褐色斑（macules）亦可在手掌、腳掌及鼻樑出現

正確答案：C. 乳癌及卵巢癌發生率不會增加